Clinical trial exclusion criterion:
Mental illness, mental retardation, or inability to participate in informed consent due to mental status

Entity relations:
- AND("inability to participate in informed consent", "mental status")
- OR("Mental illness", "inability to participate in informed consent", "mental retardation")